Clinical trial inclusion criterion:
Qb-score 1.3 or higher on at least one of the weighted summary parameters QbActivity, QbInattention or QbImpulsivity on the QbTest.

Annotated entities:
- Measurement: "Qb-score"
- Value: "1.3 or higher"